1. Justification: Subjects must be able to perform a cognitively challenging task to a high standard.

The above is a clinical trial inclusion criterion. Annotated with entity spans:
[Parsing_Error: 1.] [Not_a_criteria: Justification: Subjects must be able to perform a cognitively challenging task to a high standard.]